Entre los elementos fonológicos empleados para evaluar el lenguaje verbal en la infancia se utiliza:
1. Los balbuceos.
2. La paralingüística.
3. La proxémica.
4. La kinestesia.
5. La comunicación artefactual.

Respuesta correcta: 1. Los balbuceos.